Clinical trial exclusion criterion:
myocardial infarction within the preceding 4 weeks

Annotated entities:
- Condition: "myocardial infarction"
- Temporal: "within the preceding 4 weeks"
- Reference_point: "the preceding 4 weeks"